En la iniciación de los movimientos voluntarios la primera zona que se activa es:
1. Corteza premotora.
2. Corteza motora primaria.
3. Tallo cerebral.
4. Cerebelo.
5. Ganglios basales.

Respuesta correcta: 1. Corteza premotora.